2. Presence of P. knowlesi malaria, confirmed by positive blood smear with asexual forms of P. knowlesi.

The above is a clinical trial inclusion criterion. Annotated with entity spans:
[Parsing_Error: 2.] Presence of [Condition: P. knowlesi malaria], confirmed by [Value: positive] [Measurement: blood smear] [Qualifier: with asexual forms of P. knowlesi].